Subjects were not to have had treatment with any known enzyme-altering agents (barbiturates, phenothiazines, cimetidine etc.) within 30 days prior to or during the study.

The above is a clinical trial exclusion criterion. Annotated with entity spans:
Subjects were not to have had treatment with any known [Drug: enzyme-altering agents] ([Drug: barbiturates], [Drug: phenothiazines], [Drug: cimetidine] etc.) [Temporal: within 30 days prior to or during the study].